Breastfeeding or pregnant (intention to become) females or participation in other clinical trials

The above is a clinical trial exclusion criterion. Annotated with entity spans:
[Observation: Breastfeeding] or [Condition: pregnant] (intention to become) [Person: females] or participation in other clinical trials